Sexually active

The above is a clinical trial inclusion criterion. Annotated with entity spans:
[Observation: Sexually active]